Clinical trial inclusion criterion:
Clinical condition of the patient allows to carry out induction therapy: ECOG performance status: ≤ 2 and the Hematopoietic Cell Transplant-Co-morbidity Index (HCT-I): ≤3

Entity relations:
- Has_value("ECOG performance status", "≤ 2")
- Has_value("Hematopoietic Cell Transplant-Co-morbidity Index (HCT-I)", "≤3")